42歲女性突發呼吸困難、嘔吐、胸骨後疼痛並且延伸到上顎部。病人最後陷入意識不清及暈厥。影像學檢查 發現升主動脈（ascending aorta）中度擴張，內膜出現裂口（tear）。身體檢查顯示此病人身長高於同年齡
 者，上肢水平長度亦大於身高。下列何者最能代表其主動脈病變？
A. 囊狀中膜變性併主動脈剝離
B. 嚴重粥狀硬化併動脈瘤
C. 主動脈炎併有淋巴球及漿細胞浸潤
D. 粥腫併化膿性感染

正確答案：A. 囊狀中膜變性併主動脈剝離